Clinical trial inclusion criterion:
Children with written informed consent from parent/guardian.

Annotated entities:
- Informed_consent: "Children with written informed consent from parent/guardian"